5. Diagnosis of degenerative cognitive impairment based on clinical and/or neuroradiological findings (i.e., patients with prevailing memory impairment, or with medial temporal atrophy on brain MRI in absence of evident vascular abnormalities; i.e., Alzheimer disease as defined using the National Institute of Neurological and Communicative Disorders and Stroke/Alzheimer's Disease and Related Disorders Association criteria, Parkinson disease, Huntington disease, frontotemporal dementia).

The above is a clinical trial exclusion criterion. Annotated with entity spans:
[Parsing_Error: 5.] Diagnosis of [Condition: degenerative cognitive impairment] based on [Condition: clinical and/or neuroradiological findings] (i.e., patients with prevailing [Condition: memory impairment], or with [Condition: medial temporal atrophy] on [Procedure: brain MRI] in [Negation: absence] of [Subjective_judgement: evident] [Condition: vascular abnormalities]; i.e., [Condition: Alzheimer disease] as defined using the [Measurement: National Institute of Neurological and Communicative Disorders and Stroke/Alzheimer's Disease and Related Disorders Association criteria], [Condition: Parkinson disease], [Condition: Huntington disease], [Condition: frontotemporal dementia]).